Clinical trial exclusion criterion:
Left Bundle Branch Block

Annotated entities:
- Condition: "Left Bundle Branch Block"